Clinical Administered PTSD Scale 5 Monthly version Criteria A and >30 points

The above is a clinical trial inclusion criterion. Annotated with entity spans:
[Measurement: Clinical Administered PTSD Scale] 5 Monthly version [Value: Criteria A] and [Value: >30 points]